Clinical trial exclusion criterion:
contraindications to brachial plexus block (e.g., allergy to local anaesthetics, malignancy or infection in the area);

Annotated entities:
- Condition: "contraindications"
- Procedure: "brachial plexus block"
- Condition: "allergy"
- Drug: "local anaesthetics"
- Condition: "malignancy"
- Condition: "infection"
- Qualifier: "in the area"